Clinical trial exclusion criterion:
Pervasive developmental disorder (PDD)

Annotated entities:
- Condition: "Pervasive developmental disorder"
- Condition: "PDD"